Patient has both clinically significant findings and unexplained clinically significant alarm symptoms

The above is a clinical trial exclusion criterion. Annotated with entity spans:
Patient has both [Condition: clinically significant findings] and [Qualifier: unexplained] [Condition: clinically significant alarm symptoms]